Mujer de 45 años, madre de tres hijos, acude a consulta de diagnóstico precoz. La citología cervicovaginal es compatible con lesión escamosa intraepitelial de alto grado. ¿Cuál de las siguientes opciones elegiría?
1. Repetir la citología en 1 mes.
2. Colposcopia con eventual biopsia.
3. Histerectomía con salpinguectomía bilateral y conservación de ovarios.
4. Legrado uterino fraccionado.

Respuesta correcta: 2. Colposcopia con eventual biopsia.